Clinical trial exclusion criterion:
significant history of head trauma/surgery or seizure disorder

Entity relations:
- Has_temporal("head trauma", "history")
- Has_qualifier("history", "significant")
- OR("head trauma", "seizure disorder", "head surgery")